胎兒腹水的嚴重程度與下列何者呈現正相關？
A. 胎兒貧血的嚴重程度（degree and severity of anemia）
B. 胎兒的心輸出量（cardiac output）
C. 胎兒的低蛋白血症（hypoproteinemia）
D. 胎兒的門脈高壓症（portal hypertension）

正確答案：A. 胎兒貧血的嚴重程度（degree and severity of anemia）